Which two drugs are included in the Entresto pill?

Entresto includes Sacubitril and Valsartan.